Clinical trial exclusion criterion:
Renal insufficiency (eGFR < 60 mL/kg/min)

Entity relations:
- Has_value("eGFR", "< 60 mL/kg/min")
- Subsumes("Renal insufficiency", "eGFR")